cardiac reoperations

The above is a clinical trial exclusion criterion. Annotated with entity spans:
[Procedure: cardiac reoperations]